沒有生理壓力的正常成人使用全靜脈營養（total parenteral nutrition），蛋白質之供應量正常要給多少？
A. 0.5 g / kg / day
B. 0.8 g / kg / day
C. 1.0 g / kg / day
D. 1.5 g / kg / day

正確答案：B. 0.8 g / kg / day